Clinical trial inclusion criterion:
SCI ( 2 months of injury)

Entity relations:
- Has_temporal("SCI", "2 months of injury")